Clinical trial inclusion criterion:
Critically ill patients (typically admitted to the intensive care unit)

Annotated entities:
- Condition: "Critically ill"
- Visit: "intensive care unit"
- Mood: "typically"
- Procedure: "admitted"